對於肺結核病之治療，下列何者錯誤？
A. 以 isoniazid, rifampin, pyrazinamide 及 ethambutol 治療 2 個月，再以 isoniazid 加 rifampin 治療 4 個月即可
B. 可以每天投予藥物也可以隔天投藥
C. 孕婦得結核時應避免使用 ethambutol
D. Ethambutol 之可能併發症為 Optic neuritis

正確答案：C. 孕婦得結核時應避免使用 ethambutol